¿Para cuál de los siguientes problemas infantiles se ha demostrado la eficacia de la técnica del modelado simbólico?
1. La depresión infantil.
2. Los trastornos de conducta asociados al TDAH.
3. El autismo.
4. La timidez.
5. El mutismo selectivo.

Respuesta correcta: 4. La timidez.